El anestésico local procaína es un fármaco diseñado por farmacomodulación de la:
1. Morfina.
2. Melatonina.
3. Tetraciclina.
4. Cocaína.
5. Noradrenalina.

Respuesta correcta: 4. Cocaína.